對於雙極性疾患（bipolar disorder）治	之敘述，何者正確？
A. 急性躁期可以給予鋰鹽、抗癲癇藥物、或抗精神病藥物治療
B. 維持（maintenance）治療可使用抗癲癇藥物或鋰鹽，但只有鋰鹽需進行血中藥物濃度監測
C. 抗癲癇藥物 lamotrigine 對於預防躁症效果優於其他抗癲癇藥物
D. 電痙攣治	（electroconvulsive therapy）不適合治療雙極性疾患之鬱期

正確答案：A. 急性躁期可以給予鋰鹽、抗癲癇藥物、或抗精神病藥物治療